At the patient level, all hip fractures seen by a participating ED physician will be eligible

The above is a clinical trial inclusion criterion. Annotated with entity spans:
[Context_Error: At the patient level], all [Condition: hip fracture]s [Non-query-able: seen by a participating ED physician will be eligible]